Clinical trial exclusion criterion:
The existence of subretinal hemorrhage area constituting =50% of total lesion area

Entity relations:
- Has_value("subretinal hemorrhage area", "=50% of total lesion area")